下列何者位於闊韌帶（broad ligament）的後方？
A. 膀胱
B. 卵巢
C. 子宮
D. 子宮圓韌帶

正確答案：B. 卵巢